Clinical trial inclusion criterion:
10. Ability to understand the nature of this study, give written informed consent, and comply with study requirements.

Annotated entities:
- Post-eligibility: "Ability to understand the nature of this study, give written informed consent, and comply with study requirements."